Clinical trial inclusion criterion:
toxicity, intolerance or virological failure if receiving an NNRTI containing regimen at screening

Annotated entities:
- Condition: "toxicity"
- Condition: "intolerance"
- Condition: "virological failure"
- Drug: "NNRTI"
- Procedure: "NNRTI containing regimen"
- Temporal: "at screening"